竇房結（SA Node）之正確解剖位置為何？
A. 下腔靜脈及右心房交界處
B. 三尖瓣環及下腔靜脈夾角處
C. 肺靜脈及左心房交界處
D. 上腔靜脈及右心房交界處

正確答案：D. 上腔靜脈及右心房交界處